Clinical trial exclusion criterion:
History of deep venous insufficiency, chronic venous leg ulcer or stasis dermatitis

Annotated entities:
- Condition: "deep venous insufficiency"
- Condition: "chronic venous leg ulcer"
- Condition: "stasis dermatitis"
- Temporal: "History"